Clinical trial inclusion criterion:
Patients in the cardiothoracic intensive care after cardiac surgery with cardiopulmonary bypass

Annotated entities:
- Visit: "cardiothoracic intensive care"
- Temporal: "after cardiac surgery with cardiopulmonary bypass"
- Procedure: "cardiac surgery"
- Reference_point: "cardiac surgery with cardiopulmonary bypass"
- Procedure: "cardiopulmonary bypass"